有關神經電生理的神經傳導測試H-反射（H-reflex）及F-波（F-wave）敘述，何者正確？
A. H-反射是一種單突觸反射（monosynaptic reflex）
B. F-波常出現在M-波前面
C. F-波振幅常比H-反射大
D. 因F-波必須用超強度（supramaximal）的電流刺激，所以出現的時間較H-反射固定

正確答案：A. H-反射是一種單突觸反射（monosynaptic reflex）